3. Persistent pulmonary hypertension of the newborn

The above is a clinical trial exclusion criterion. Annotated with entity spans:
[Parsing_Error: 3.] [Qualifier: Persistent] [Condition: pulmonary hypertension of the newborn]